Clinical trial exclusion criterion:
9. History of myocardial infarction, angina, congestive heart failure, cardiomyopathy, stroke or transient ischemic attack, or any heart condition currently under medical care.

Entity relations:
- Has_temporal("under medical care", "currently")
- Has_qualifier("heart condition", "under medical care")
- Has_temporal("myocardial infarction", "History")
- Has_temporal("transient ischemic attack", "History")
- OR("myocardial infarction", "cardiomyopathy", "congestive heart failure", "angina", "stroke")
- OR("myocardial infarction", "heart condition")
- OR("transient ischemic attack", "heart condition")